Clinical trial inclusion criterion:
History of taking an alpha blocker (tamsulosin/ terazosin/doxazosin/alfuzosin/silodosin) medication

Annotated entities:
- Drug: "alpha blocker"
- Drug: "tamsulosin"
- Drug: "terazosin"
- Drug: "doxazosin"
- Drug: "alfuzosin"
- Drug: "silodosin"